Clinical trial exclusion criterion:
9. Uncontrolled or intercurrent illness including, that in the opinion of the investigator may increase the risks associated with study participation or administration of the investigational products, or that may interfere with the interpretation of the results.

Annotated entities:
- Qualifier: "Uncontrolled"
- Temporal: "intercurrent"
- Condition: "illness"
- Qualifier: "in the opinion of the investigator may increase the risks"
- Subjective_judgement: "in the opinion of the investigator may increase the risks"
- Post-eligibility: "9. Uncontrolled or intercurrent illness including, that in the opinion of the investigator may increase the risks associated with study participation or administration of the investigational products, or that may interfere with the interpretation of the results."